Name 3 diseases for which lucatumumab is being tested?

Lucatumumab is being tested as treatment for malignancies such as chronic lymphatic leukemia (CLL), Multiple Myeloma (MM), and non-Hodgkin's lymphoma (NHL).